Clinical trial inclusion criterion:
5. > 18 years old

Entity relations:
- Has_value("old", "18 years")